Already taking Metformin or any other drug intended to treat diabetes

The above is a clinical trial exclusion criterion. Annotated with entity spans:
Already taking [Drug: Metformin] or any other [Drug: drug] intended to treat [Qualifier: diabetes]